Clinical trial exclusion criterion:
Previous discontinuation of treatment with deferiprone or deferoxamine due to adverse events;

Entity relations:
- AND("discontinuation of treatment", "deferiprone")
- OR("deferiprone", "deferoxamine")